Systemic therapy or radiotherapy within 4 weeks prior to Day 1

The above is a clinical trial exclusion criterion. Annotated with entity spans:
[Procedure: Systemic therapy] or [Procedure: radiotherapy] [Temporal: within 4 weeks prior to Day 1]